受外力造成股骨的大轉子（greater trochanter）破損，下列何者最不受影響？
A. 上孖肌
B. 下孖肌
C. 股方肌
D. 閉孔內肌

正確答案：C. 股方肌